Clinical trial exclusion criterion:
Severe kidney failure (eGFR<15 ml/min)

Annotated entities:
- Qualifier: "Severe"
- Condition: "kidney failure"
- Measurement: "eGFR"
- Value: "<15 ml/min"